下列何種藥物是透過抑制 phosphodiesterase III 而改善 congestive heart failure？
A. Dobutamine
B. Captopril
C. Digoxin
D. Milrinone

正確答案：D. Milrinone